Clinical trial inclusion criterion:
Willing to attempt to abstain from alcohol completely for the duration of the study

Entity relations:
- Has_qualifier("abstain from alcohol", "completely")
- Has_mood("abstain from alcohol", "Willing")